Clinical trial inclusion criterion:
The planned procedure can be any of the following: For diagnostic purposes (coronary angiography only, left catheterization, left and right catheterization). For therapeutic purposes: percutaneous coronary intervention (PCI), with or without stent placement.

Entity relations:
- Has_qualifier("coronary angiography", "only")
- AND("coronary angiography", "left catheterization")
- AND("coronary angiography", "left catheterization")
- Has_qualifier("coronary angiography", "diagnostic")
- Subsumes("percutaneous coronary intervention", "PCI")
- Has_qualifier("percutaneous coronary intervention", "therapeutic")
- AND("percutaneous coronary intervention", "stent placement")
- Subsumes("procedure", "coronary angiography")
- AND("coronary angiography", "right catheterization")
- OR("coronary angiography", "coronary angiography", "coronary angiography")
- OR("coronary angiography", "percutaneous coronary intervention")